根據學理與最近的研究，下列腫瘤中何者是人類乳突病毒陽性率最高的腫瘤？
A. 鼻腔癌
B. 口咽癌
C. 下咽癌
D. 喉癌

正確答案：B. 口咽癌